關於熱性痙攣之發生原因及處置，下列何項敘述較不適當？
A. 常與嬰兒玫瑰疹（人類疱疹病毒第六型感染）有關
B. 若病患精神活力不佳，須排除中樞神經感染
C. 腦波檢查為單純熱性痙攣之常規檢查
D. 若意識持續未恢復，須檢	血糖以鑑別低血糖之昏迷

正確答案：C. 腦波檢查為單純熱性痙攣之常規檢查